心臟上緣（superior border）主要由下列何者形成？
A. 大脈管根部
B. 右心房
C. 左心室
D. 右心室

正確答案：A. 大脈管根部